The presence of at least one lesion that can be accurately assessed at baseline by Computerised Tomography (CT), Magnetic Resonance Imaging (MRI) or plain X-ray and is suitable for repeated assessment

The above is a clinical trial inclusion criterion. Annotated with entity spans:
The presence of [Multiplier: at least one] [Condition: lesion] that can be [Qualifier: accurately assessed at baseline] by [Procedure: Computerised Tomography (CT)], [Procedure: Magnetic Resonance Imaging (MRI)] or [Procedure: plain X-ray] and is [Qualifier: suitable for repeated assessment]